Clinical trial exclusion criterion:
Patients requiring emergent cesarean birth

Annotated entities:
- Procedure: "emergent cesarean birth"